What is the Formalin test used for?

And persistent pain produced by peripheral tissue injury and inflammation was modeled by formalin test.